Clinical trial exclusion criterion:
periodontal treatment in the last year (before baseline appointment)

Annotated entities:
- Procedure: "periodontal treatment"
- Temporal: "in the last year"
- Temporal: "before baseline appointment"
- Procedure: "baseline appointment"
- Reference_point: "baseline appointment"